La proteína RecA bacteriana:
1. Funciona como un ribointerruptor.
2. Es una enzima que se une al ribosoma.
3. Facilita la síntesis del represor LexA.
4. Induce la expresión de los genes SOS.

Respuesta correcta: 4. Induce la expresión de los genes SOS.